Clinical trial exclusion criteria:
Diagnosis of brainstem glioma
Concurrent administration of any other anti-tumor therapy
Pre-existing uncontrolled diarrhea

Annotated entities:
- Condition: "brainstem glioma"
- Procedure: "anti-tumor therapy"
- Temporal: "Concurrent"
- Qualifier: "any other"
- Condition: "uncontrolled diarrhea"